Clinical trial exclusion criterion:
Use of medications that interact with contraceptive steroid hormones: anti-epileptic medications, rifampin, rifabutin, fosamprenavir, etc

Entity relations:
- Has_context("medications", "interact with")
- AND("interact with", "contraceptive steroid hormones")
- Subsumes("medications", "anti-epileptic medications")
- OR("anti-epileptic medications", "rifabutin", "rifampin", "fosamprenavir")